下列有關鎮靜-催眠（sedative-hypnotic）用藥在逐漸提高使用劑量時，其所產生中樞神經系統作用之序列，何者正確？
A. 鎮靜（sedation）→麻醉（anesthesia）→催眠（hypnosis）→昏迷（coma）
B. 催眠（hypnosis）→鎮靜（sedation）→麻醉（anesthesia）→昏迷（coma）
C. 催眠（hypnosis）→麻醉（anesthesia）→鎮靜（sedation）→昏迷（coma）
D. 鎮靜（sedation）→催眠（hypnosis）→麻醉（anesthesia）→昏迷（coma）

正確答案：D. 鎮靜（sedation）→催眠（hypnosis）→麻醉（anesthesia）→昏迷（coma）